La función de la proteína GS en la activación de la adenilato ciclasa es:
1. La proteína GS forma un complejo con la hormona, y el complejo hormona-proteína GS activa la adenilato ciclasa.
2. La activación del receptor por la hormona elimina la inhibición de la adenilato ciclasa por la proteína GS.
3. La proteína GS activa la adenilato ciclasa en una reacción impulsada por la hidrólisis de GTP a GDP.
4. La subunidad Gα de la proteína GS intercambia GDP por GTP, se disocia de las subunidades Gβγ y activa la adenilato ciclasa.

Respuesta correcta: 4. La subunidad Gα de la proteína GS intercambia GDP por GTP, se disocia de las subunidades Gβγ y activa la adenilato ciclasa.